Clinical trial exclusion criterion:
History of allergy or intolerance to any of the study drugs

Entity relations:
- Has_temporal("allergy", "History")
- AND("allergy", "study drugs")
- OR("allergy", "intolerance")